Clinical trial exclusion criterion:
Hemoglobin <8 or diagnosed with anemia

Entity relations:
- Has_value("Hemoglobin", "<8")
- OR("Hemoglobin", "anemia")